Clinical trial inclusion criterion:
Patients who consented to participate in the study by signing the informed consent form before the transplant surgery to the 1st post-operative day).

Annotated entities:
- Informed_consent: "Patients who consented to participate in the study by signing the informed consent form before the transplant surgery to the 1st post-operative day)"